Clinical trial exclusion criterion:
Any intraocular inflammation in the study eye present during the screening slit lamp examination

Entity relations:
- Has_index("during the screening slit lamp examination", "the screening slit lamp examination")
- Has_value("slit lamp examination", "intraocular inflammation")
- Has_temporal("slit lamp examination", "during the screening slit lamp examination")